Be able and willing to learn clean intermittent self catheterization technique

The above is a clinical trial inclusion criterion. Annotated with entity spans:
[Non-query-able: Be able and willing to learn clean intermittent self catheterization technique]